一位 68 歲男性，長期酗酒，因發燒、咳嗽併咖啡色濃痰、呼吸困難，胸部 X 光顯示右上肺野白色堅實性變化（consolidation）合併肺葉間隙鼓漲（bulging interlobar fissure），此病患肺部感染的菌種最可能為何？
A. 結核菌
B. 克雷白氏肺炎桿菌（Klebsiella pneumoniae）
C. 肺炎雙球菌
D. 肺炎黴漿菌（Mycoplasma pneumoniae）

正確答案：B. 克雷白氏肺炎桿菌（Klebsiella pneumoniae）